Clinical trial inclusion criterion:
HCV naive

Annotated entities:
- Measurement: "HCV"
- Value: "naive"
- Condition: "HCV naive"